在胎兒時期，卵圓孔（oval foramen）可溝通下列何者？
A. 主動脈與肺動脈
B. 右心房與右心室
C. 右心房與左心房
D. 右心室與左心室

正確答案：C. 右心房與左心房